Allergy to acetazolamide and other sulfonamides.

The above is a clinical trial exclusion criterion. Annotated with entity spans:
[Condition: Allergy] to [Drug: acetazolamide] and other [Drug: sulfonamides].